Clinical trial inclusion criterion:
Women subjected to ICSI through controlled ovarian hyperstimulation (COH) with pituitary downregulation by GnRH antagonist.

Entity relations:
- Subsumes("ovarian hyperstimulation", "COH")
- AND("ICSI", "GnRH antagonist")
- AND("GnRH antagonist", "ovarian hyperstimulation")
- AND("GnRH antagonist", "pituitary downregulation")